Clinical trial exclusion criterion:
Treatment with prednisolone (or prednisone, or equivalent) at >20 mg/D for over 4 weeks within the past 3 months.

Entity relations:
- Has_multiplier("prednisolone", ">20 mg/D for over 4 weeks")
- Has_temporal("prednisolone", "past 3 months")
- OR("prednisolone", "prednisone equivalent", "prednisone")